Clinical trial exclusion criterion:
2. Subject underwent cardiac pacemaker treatment;

Annotated entities:
- Procedure: "cardiac pacemaker treatment"
- Device: "cardiac pacemaker"